下列那一樣藥物會抑制Carbonic anhydrase而減少眼房液之形成？
A. Amiloride
B. Dorzolamide
C. Torsemide
D. Bumetanide

正確答案：B. Dorzolamide